¿Cuál de las siguientes manifestaciones es MENOS probable en la nefritis túbulo-intersticial?:
1. Proteinuria superior a 3,5 g en 24 horas.
2. Diabetes insípida nefrógena.
3. Insuficiencia renal progresiva.
4. Acidosis tubular renal.

Respuesta correcta: 1. Proteinuria superior a 3,5 g en 24 horas.